Clinical trial exclusion criterion:
ASA physical state >II

Entity relations:
- Has_value("ASA physical state", ">II")